Clinical trial exclusion criterion:
less than 18 years of age of more than 80 years of age

Entity relations:
- Has_value("age", "less than 18 years")
- Has_value("age", "more than 80 years")
- OR("age", "age")